El glucagón tiene un efecto positivo sobre una de las siguientes enzimas relacionadas con el metabolismo de la glucosa en el hígado:
1. Glucógeno sintasa.
2. Fosfofructoquinasa 1.
3. Piruvato quinasa.
4. Fosfoenolpiruvato carboxiquinasa.

Respuesta correcta: 4. Fosfoenolpiruvato carboxiquinasa.